La persuasión es una forma de modificar actitudes. ¿Cuál de los siguientes enunciados NO es correcto?:
1. La fuente que comunica un mensaje tiene que ser creíble, atractiva, cercana y afín.
2. El mensaje positivo persuade mejor que el negativo o el neutro.
3. Los estados de ánimo positivos favorecen más la persuasión que los estados neutrales.
4. Las actitudes de las personas con alta necesidad cognitiva son más difíciles de modificar sobre todo si se utilizan argumentos débiles.
5. La autoestima del receptor no influye en la persuasión.

Respuesta correcta: 5. La autoestima del receptor no influye en la persuasión.